Clinical trial inclusion criteria:
Females undergoing Intra-Cytoplasmic Sperm Injection (ICSI) cycles
Age between 20 and 40 years

Annotated entities:
- Procedure: "Intra-Cytoplasmic Sperm Injection (ICSI) cycles"
- Temporal: "undergoing"
- Person: "Females"
- Person: "Age"
- Value: "between 20 and 40 years"